¿Con qué fin proponen Clark y Beck (2010), dentro de la terapia cognitiva de los trastornos de ansiedad, los ejercicios de inducción de síntomas en el tratamiento del trastorno de pánico?:
1. Para provocar la integración de los procesos reflexivos de nivel superior de procesamiento cognitivo.
2. Para crear oportunidades de desafiar las malinterpretaciones catastróficas de las sensaciones corporales.
3. Para facilitar el uso de la meditación autoguiada.
4. Para generar nuevas conductas de búsqueda de seguridad.
5. La inducción de síntomas no se contempla en el modelo de terapia cognitiva de la ansiedad.

Respuesta correcta: 2. Para crear oportunidades de desafiar las malinterpretaciones catastróficas de las sensaciones corporales.